Clinical trial inclusion criterion:
not taking medications other than oral contraceptives

Entity relations:
- Has_negation("oral contraceptives", "other than")
- AND("medications", "oral contraceptives")
- Has_negation("medications", "not")